一位 56 歲男性卡車司機，於車禍中胸部直接撞在方向盤上，送到急診室時主訴胸口疼痛出現冒汗（diaphoretic），他的血壓為 60/40 mmHg，呼吸速率 40 次／分。為分辨病患之低血壓是來自心包膜填塞（cardiac tamponade）或張力性氣胸（tension pneumothorax），下列何者為最佳鑑別診斷工具？
A. 心搏過速（Tachycardia）
B. 脈搏壓（Pulse pressure）
C. 呼吸音（Breath sounds）
D. 頸靜脈壓（Jugular venous pressure）

正確答案：C. 呼吸音（Breath sounds）